下列何者與兒童急性白血病的預後關係最小？
A. 特殊染色體型
B. 有無肝臟及脾臟腫大
C. 有無侵犯中樞神經系統
D. 對初步化療的反應

正確答案：B. 有無肝臟及脾臟腫大